Clinical trial inclusion criterion:
Primary or secondary infertility: tubal occlusion, male factor, unexplained, endometriosis, ovarian factors…

Annotated entities:
- Condition: "Primary infertility"
- Condition: "secondary infertility"
- Condition: "tubal occlusion"
- Observation: "male factor"
- Observation: "unexplained factors"
- Condition: "endometriosis"
- Observation: "ovarian factors"